Una de las aportaciones más importantes e innovadores de la terapia dialéctica comportamental en el tratamiento del trastorno de la personalidad límite (TPL) es:
1. La integración de la perspectiva psicodinámica y la perspectiva comportamental.
2. La incorporación de la terapia de grupo.
3. La introducción de material escrito para los pacientes como apoyo a la terapia.
4. El énfasis en la aceptación y validación como prerrequisito para conseguir el cambio.
5. El tratamiento de los pacientes con TLP en el marco de la terapia familiar.

Respuesta correcta: 4. El énfasis en la aceptación y validación como prerrequisito para conseguir el cambio.